Clinical trial exclusion criterion:
not in menopause and not have hot flashes

Entity relations:
- Has_negation("hot flashes", "not")
- Has_negation("menopause", "not")
- OR("menopause", "hot flashes")